45歲女性病人，接受腹膜透析，3天前腹痛，1天前透析液變混濁，今天至急診，透析液中的白血球356/μL，用抗生素治療3天後，透析液培養長出念珠菌（candidiasis）。下列何種處置最為適當？
A. 使用口服抗黴菌藥物
B. 使用靜脈注射抗黴菌藥物
C. 使用腹腔灌注抗黴菌藥物
D. 拔除腹膜透析導管

正確答案：D. 拔除腹膜透析導管